El INR (cociente internacional normalizado) de un paciente con fibrilación auricular crónica tratado con Acenocumarol es de 4. Este resultado le indica que:
1. Se debe controlar la aparición de arritmias ventriculares.
2. El paciente está correctamente anticoagulado.
3. Está más indicada la anticoagulación con heparina.
4. Existe riesgo de formación de trombos.
5. Se deben valorar signos de hemorragia.

Respuesta correcta: 5. Se deben valorar signos de hemorragia.